Blasts = 1,000/µL in PB on day 8

The above is a clinical trial inclusion criterion. Annotated with entity spans:
[Line: Blasts = 1,000/µL in PB on day 8]